Clinical trial inclusion criterion:
patient well responders

Annotated entities:
- Condition: "well responders"